Clinical trial exclusion criterion:
History of suicidal behavior or suicidal ideation as indicated by the C-SSRS, administered at screening (the questionnaire is provided in Appendix 4), and as per investigator's judgment.

Annotated entities:
- Observation: "suicidal behavior"
- Condition: "suicidal ideation"